單獨給予下列何種降血壓藥物，易引起反射性心跳過快及 renin 的釋放？
A. Propranolol
B. Diazoxide
C. Enalapril
D. Clonidine

正確答案：B. Diazoxide